Orthostatic hypotension after 3-minute standing (systolic blood pressure drop >=20 or diastolic blood pressure drop >=10

The above is a clinical trial inclusion criterion. Annotated with entity spans:
[Condition: Orthostatic hypotension] [Qualifier: after 3-minute standing] ([Measurement: systolic blood pressure drop] [Value: >=20] or [Measurement: diastolic blood pressure drop] [Value: >=10]